細胞內訊息傳遞分子（intracellular signaling molecules），下列何種系列是最常見的組合？
A. phospholipase C，cAMP，PKA
B. adenylate cyclase，cAMP，PKC
C. adenylate cyclase，diacylglycerol，PKA
D. phopholipase C，diacylglycerol，PKC

正確答案：D. phopholipase C，diacylglycerol，PKC